有關流產敘述，下列何者錯誤？
A. 先兆性流產（threatened abortion），通常最終導致流產
B. 子宮頸口已開，懷孕組織還未掉出來，稱無可避免的流產（inevitable abortion）
C. 已有部分懷孕組織排出，稱不完全流產（incomplete abortion）
D. 若不完全流產病患有發燒現象，應給予抗生素

正確答案：A. 先兆性流產（threatened abortion），通常最終導致流產